¿Cuál de los productos siguientes de la degradación de los triacilgliceroles y posterior oxidación puede sufrir gluconeogénesis?
1. Propionil CoA.
2. Acetil CoA.
3. Todos los cuerpos cetónicos.
4. Algunos aminoácidos.
5. -Hidroxibutirato.

Respuesta correcta: 1. Propionil CoA.